一個月大的嬰兒因為白色大便而住院檢查。其血中 direct bilirubin 為 5.0 mg/dL。血液、尿液、細菌及病毒檢查為為陰性。則在下列檢查中，何種診斷膽道閉鎖最可靠？
A. 核醫 DISIDA 肝掃描
B. 腹部超音波
C. 經皮肝切片
D. 十二指腸液分析

正確答案：C. 經皮肝切片